Treatment with GLP-1 analogues, Dipeptidyl peptidase-4 inhibitors, or glitazones

The above is a clinical trial exclusion criterion. Annotated with entity spans:
Treatment with [Drug: GLP-1 analogues], [Drug: Dipeptidyl peptidase-4 inhibitors], or [Drug: glitazones]